Clinical trial exclusion criterion:
the history or family history of anaphylaxis, convulsion, epilepsy, encephalopathy and psychosis

Annotated entities:
- Temporal: "history"
- Observation: "family history"
- Condition: "anaphylaxis"
- Condition: "convulsion"
- Condition: "epilepsy"
- Condition: "encephalopathy"
- Condition: "psychosis"